Clinical trial exclusion criterion:
the child has experienced a severe allergic reaction after previous vaccination, drug or food.

Entity relations:
- Has_index("after previous vaccination, drug or food", "previous vaccination, drug or food")
- Has_temporal("vaccination", "previous")
- multi("previous vaccination, drug or food", "vaccination")
- Has_temporal("severe allergic reaction", "after previous vaccination, drug or food")
- OR("vaccination", "drug", "food")